Clinical trial inclusion criterion:
High risk for thromboembolic events (i.e., CHADS2 score = 2 or CHA2DS2-VASc score = 3) and require OAT before undergoing cardiac ablation

Annotated entities:
- Observation: "risk for thromboembolic events"
- Value: "High"
- Measurement: "CHADS2 score"
- Value: "= 2"
- Measurement: "CHA2DS2-VASc score"
- Value: "= 3"
- Drug: "OAT"
- Temporal: "before undergoing cardiac ablation"
- Reference_point: "cardiac ablation"